Clinical trial exclusion criterion:
on going neoplastic history with a short prognosis,

Annotated entities:
- Temporal: "on going"
- Condition: "neoplastic"
- Temporal: "history"
- Value: "short"
- Measurement: "prognosis"